The diagnosis of community-acquired pneumoniae

The above is a clinical trial inclusion criterion. Annotated with entity spans:
The diagnosis of [Condition: community-acquired pneumoniae]